Stoke since less than 2 month

The above is a clinical trial inclusion criterion. Annotated with entity spans:
[Condition: Stoke] [Temporal: since less than 2 month]